Clinical trial inclusion criterion:
Reference vessel size 2.5 mm by visual estimation

Annotated entities:
- Value: "2.5 mm"
- Measurement: "Reference vessel size by visual estimation"